Clinical trial inclusion criteria:
Toxic epidermal necrolysis with SCORTEN 1 to 5 at admission

Annotated entities:
- Condition: "Toxic epidermal necrolysis"
- Measurement: "SCORTEN"
- Value: "1 to 5"
- Temporal: "at admission"
- Reference_point: "admission"